Clinical trial exclusion criteria:
Contra-indication for multiorgan procurement (infections, cancer, etc)
Preexistent chronic renal failure.
Refusal for organ procurement by the donor (confirmed by the French national register or reported by the next-of-kin).
Need for a double kidney transplantation.
Need for a multiorgan transplantation

Annotated entities:
- Condition: "Contra-indication"
- Procedure: "multiorgan procurement"
- Condition: "infections"
- Condition: "cancer"
- Condition: "chronic renal failure"
- Temporal: "Preexistent"
- Procedure: "organ procurement"
- Observation: "Refusal by the donor"
- Qualifier: "French national register"
- Qualifier: "reported by the next-of-kin"
- Mood: "Need for"
- Procedure: "double kidney transplantation"
- Mood: "Need for"
- Procedure: "multiorgan transplantation"